65 歲男性發生位於左心室前及側壁的整層心肌梗塞（Transmural infarct），但心室中隔（Ventricular septum）完好。下列冠狀動脈中，何者是此患者最可能發生阻塞之處？
A. 前降支（Anterior descending branch）
B. 左迴旋支（Left circumflex branch）
C. 右迴旋支（Right circumflex branch）
D. 左主冠狀動脈（Left main coronary artery）

正確答案：B. 左迴旋支（Left circumflex branch）